Clinical trial exclusion criterion:
Current use of systemic corticosteroids in the 3 months prior this study.

Annotated entities:
- Temporal: "Current"
- Drug: "systemic corticosteroids"
- Temporal: "in the 3 months prior this study"